Clinical trial exclusion criterion:
Has not recovered adequately (i.e., Grade ≤1 or baseline) from the toxicity and/or complications from any intervention prior to study start

Annotated entities:
- Undefined_semantics: "Has not recovered adequately (i.e., Grade ≤1 or baseline) from the toxicity and/or complications from any intervention prior to study start"
- Context_Error: "Has not recovered adequately (i.e., Grade ≤1 or baseline) from the toxicity and/or complications from any intervention prior to study start"
- Subjective_judgement: "recovered adequately"